pelvic inflammatory disease

The above is a clinical trial exclusion criterion. Annotated with entity spans:
[Condition: pelvic inflammatory disease]